Which tool has been developed for proteome-wide detection of membrane lipid-binding proteins?

MBPpred is a profile Hidden Markov Model based method capable of detecting Membrane Binding Proteins (MBPs) from information encoded in their amino acid sequence.